Clinical trial inclusion criterion:
Non-cardiac condition limiting life expectancy to less than one year, per physician judgment (e.g. cancer)

Annotated entities:
- Condition: "Non-cardiac condition"
- Observation: "life expectancy"
- Temporal: "less than one year"